Arrestees examined by a physician during detention in police cells

The above is a clinical trial inclusion criterion. Annotated with entity spans:
[Person: Arrestees] [Procedure: examined by a physician] [Temporal: during detention in police cells]